¿Cuál de las siguientes descripciones es correcta para Staphylococcus saprophyticus?:
1. Tiene forma de coco y se agrupa en cadenas.
2. Se encuentra en el grupo de los denominados “estafilococos coagulasa-positiva”.
3. A diferencia de otros estafilococos no crece en agar sangre.
4. Causa infección urinaria en mujeres jóvenes.
5. Produce la toxina exfoliatina que origina el “síndrome de la piel escaldada”.

Respuesta correcta: 4. Causa infección urinaria en mujeres jóvenes.